Clinical trial inclusion criteria:
Adult men who have sex with men, and transgender women
Unaware of HIV status at enrollment in follow-up cohort
High risk for HIV infection
Willing to test for HIV
No prior ART, including prior administration of pre- and post-exposure prophylaxis in the last 30 days
Willing to provide informed consent

Annotated entities:
- Person: "Adult"
- Person: "men who have sex with men"
- Person: "transgender women"
- Measurement: "HIV status"
- Value: "Unaware"
- Observation: "Unaware of HIV status"
- Temporal: "at enrollment in follow-up cohort"
- Reference_point: "enrollment in follow-up cohort"
- Condition: "HIV infection"
- Mood: "High risk for"
- Mood: "Willing to"
- Condition: "test for HIV"
- Negation: "No"
- Temporal: "prior"
- Procedure: "ART"
- Temporal: "prior"
- Procedure: "administration"
- Drug: "post-exposure prophylaxis"
- Drug: "pre- exposure prophylaxis"
- Temporal: "in the last 30 days"
- Observation: "informed consent"
- Mood: "Willing to provide"